Clinical trial inclusion criterion:
Clinical diagnosis of allergic rhinitis based on sneeze attacks, runny/blocked/itchy nose in the absence of a common cold during the previous 12 months.

Annotated entities:
- Condition: "allergic rhinitis"
- Condition: "sneeze attacks"
- Condition: "runny nose"
- Condition: "blocked nose"
- Condition: "itchy nose"
- Condition: "common cold"
- Negation: "absence"
- Temporal: "during the previous 12 months"